Which cancer types are associated with mutations in the TWIST1 gene?

Cancer is caused by uncontrolled cell division. Mutations in TWIST1 are associated with breast cancer, prostate cancer, lung cancer, and skin cancer.